dual organ transplant

The above is a clinical trial exclusion criterion. Annotated with entity spans:
[Multiplier: dual] [Procedure: organ transplant]